Visual impairment predominantly due to abnormal new vessel ingrowth and/or macular edema. The presence of fluid (intraretinal, subretinal or sub-RPE) detected clinically or on the ocular coherence tomography.

The above is a clinical trial inclusion criterion. Annotated with entity spans:
[Condition: Visual impairment] predominantly due to [Condition: abnormal new vessel ingrowth] and/or [Condition: macular edema]. The presence of [Condition: fluid] ([Qualifier: intraretinal], [Qualifier: subretinal] or [Qualifier: sub-RPE]) detected clinically or on the [Procedure: ocular coherence tomography].